Clinical trial inclusion criterion:
Has given written informed consent.

Annotated entities:
- Informed_consent: "Has given written informed consent."